下列何者是原核生物"核苷酸去除修復（Nucleotide excision repair）＂的主要成分？
A. Ruv A, B, C, D
B. Uvr A, B, C, D
C. Rec A, Lex A, Rec BCD
D. Polymerase α, β, γ, δ

正確答案：B. Uvr A, B, C, D